Clinical trial exclusion criterion:
Hypertriglyceridemic (>400 mg/dl) and hypercholesterolemic (>260 mg/dl) subjects

Annotated entities:
- Condition: "Hypertriglyceridemic"
- Value: ">400 mg/dl"
- Measurement: "Hypertriglyceridemic"
- Condition: "hypercholesterolemic"
- Measurement: "cholesterol"
- Value: ">260 mg/dl"